Clinical trial inclusion criteria:
Patients aged at least 18 years
Patients with chronic heart failure present for at least 12 months
Confirmed presence of iron deficiency
Serum haemoglobin of 9.5 to 14.0 g/dL

Annotated entities:
- Person: "aged"
- Value: "at least 18 years"
- Condition: "chronic heart failure"
- Temporal: "for at least 12 months"
- Drug: "iron"
- Condition: "iron deficiency"
- Measurement: "Serum haemoglobin"
- Value: "9.5 to 14.0 g/dL"